12. Total serum bilirubin ≤1.5 × ULN

The above is a clinical trial inclusion criterion. Annotated with entity spans:
12. [Measurement: Total serum bilirubin] [Value: ≤1.5 × ULN]